Describe a cytokine release syndrome.

"Cytokine storm,"  is an aberrant response from the host immune system that induces an exaggerated release of proinflammatory cytokines/chemokines. I